Impairment of gastrointestinal (GI) function or GI disease that may significantly alter the absorption of dovitinib

The above is a clinical trial exclusion criterion. Annotated with entity spans:
[Condition: Impairment of gastrointestinal (GI) function] or [Condition: GI disease] that [Qualifier: may significantly alter the absorption of dovitinib]